Patients who have undergone prostatectomy: any rise in PSA or

The above is a clinical trial inclusion criterion. Annotated with entity spans:
Patients who have undergone [Procedure: prostatectomy]: any [Value: rise] in [Measurement: PSA] or